Clinical trial exclusion criteria:
Patients with Non-androgenetic causes of hair loss.
Female patients with androgenetic alopecia.
Patients who received anti-hair loss treatment within the past six months.
Patients with history of bleeding disorders or on anticoagulant therapy.
Patients with history of chronic liver disease, cancer or connective tissue disorders.
Patients with current scalp infection.

Annotated entities:
- Condition: "Non-androgenetic causes of hair loss"
- Person: "Female"
- Condition: "androgenetic alopecia"
- Procedure: "anti-hair loss treatment"
- Temporal: "within the past six months"
- Condition: "bleeding disorders"
- Procedure: "anticoagulant therapy"
- Temporal: "history"
- Condition: "chronic liver disease"
- Condition: "cancer"
- Condition: "connective tissue disorders"
- Temporal: "history"
- Temporal: "current"
- Condition: "scalp infection"